Tiene una herencia recesiva ligada al cromosoma X la:
1. Acatalasemia.
2. Hemofilia A.
3. Síndrome de Rett.
4. Fibrosis quística,
5. Hipofosfatemia.

Respuesta correcta: 2. Hemofilia A.